Clinical trial exclusion criterion:
Acute infection/inflammation (Temperature > 101.5 F, and/or WBC> 15, 000)

Entity relations:
- Has_qualifier("infection", "Acute")
- Has_value("Temperature", "> 101.5 F")
- Has_value("WBC", "> 15, 000")
- OR("infection", "inflammation")
- OR("Temperature", "WBC")